Clinical trial exclusion criterion:
Subjects taking any lipid modification therapy, including but not limited to statins, fibrates and bile acid sequestrants.

Annotated entities:
- Procedure: "lipid modification therapy"
- Drug: "statins"
- Drug: "fibrates"
- Drug: "bile acid sequestrants"
- Grammar_Error: "and"